Renal function: serum creatinine is 44-133 mmol/L;

The above is a clinical trial inclusion criterion. Annotated with entity spans:
Renal function: [Measurement: serum creatinine] is [Value: 44-133 mmol/L];